Completion of a 14-week open label trial of one the following SRI's: fluoxetine 80 mg/day, paroxetine 60 mg/day, fluvoxamine 300 mg/day, clomipramine 250 mg/day, sertraline 200 mg/day, citalopram 60 mg/day, escitalopram 30 mg/day and demonstrating a non or partial responses to SRI treatment (CGI-I of 3 or 4, Y-BOCS reduction of < 35%)

The above is a clinical trial inclusion criterion. Annotated with entity spans:
Completion of a [Multiplier: 14-week] open label trial of [Multiplier: one the following] SRI's: [Drug: fluoxetine] [Multiplier: 80 mg/day], [Drug: paroxetine] [Multiplier: 60 mg/day], [Drug: fluvoxamine] [Multiplier: 300 mg/day], [Drug: clomipramine] [Multiplier: 250 mg/day], [Drug: sertraline] [Multiplier: 200 mg/day], [Drug: citalopram] [Multiplier: 60 mg/day], [Drug: escitalopram] [Multiplier: 30 mg/day] and demonstrating a non or partial [Condition: responses to] [Procedure: SRI treatment] ([Measurement: CGI-I] of [Value: 3] or [Value: 4], [Measurement: Y-BOCS] [Value: reduction of < 35%])